「你說你不緊張，但你正在冒汗而且雙手也在顫抖，看起來很煩躁的樣子」，這是下列那一會談技巧（interview skill）的運用？
A. 面質（confrontation）
B. 促進（facilitation）
C. 反射（reflection）
D. 直接式問題（direct question）

正確答案：A. 面質（confrontation）